Clinical trial exclusion criterion:
preoperative use of either pregabalin, gabapentin or strong opiates

Annotated entities:
- Temporal: "preoperative"
- Drug: "pregabalin"
- Drug: "gabapentin"
- Drug: "strong opiates"